Clinical trial exclusion criterion:
current alcohol abuse or drug dependence

Annotated entities:
- Condition: "alcohol abuse"
- Condition: "drug dependence"
- Temporal: "current"